Clinical trial exclusion criterion:
estrogen-progestin therapy in the 2 months before enrollment,

Annotated entities:
- Procedure: "estrogen-progestin therapy"
- Temporal: "in the 2 months before enrollment"